Clinical trial exclusion criterion:
PD on first-line therapy.

Entity relations:
- Has_qualifier("PD", "first-line therapy")